Clinical trial exclusion criteria:
Prior endobronchial treatment for emphysema
Pleural or interstitial disease that precludes surgery.
Prior lung transplant, LVRS, median sternotomy, bullectomy or lobectomy.
Clinically significant bronchiectasis
Pulmonary nodule requiring surgery
History of recurrent respiratory infections (> 3 hospitalization in the last year)
Clinically significant (> 4 Tablespoons per day) sputum production
Fever, elevated white cell count, or other evidence of active infection
Dysrhythmia that might pose a risk during exercise or training
Congestive heart failure within 6 mo and LVEF < 45%
Evidence or history of Cor Pulmonale
Resting bradycardia (< 50 beats/min), frequent multifocal PVCs, complex ventricular arrhythmia, sustained SVT
History of exercise-related syncope
MI within 6 mo and LVEF < 45%
Evidence of systemic disease or neoplasia expected to compromise survival during 5-yr period
Any disease or condition that interferes with completion of initial or follow-up assessments
Patient is currently enrolled in another clinical trial
Patient is unable to complete 3 minutes of unloaded peddling on cycle ergometer
Alpha-1-Antitrypsin Deficiency

Annotated entities:
- Procedure: "endobronchial treatment"
- Condition: "emphysema"
- Temporal: "Prior"
- Condition: "Pleural disease"
- Condition: "interstitial disease"
- Procedure: "surgery"
- Negation: "precludes"
- Qualifier: "precludes surgery"
- Procedure: "lung transplant"
- Temporal: "Prior"
- Procedure: "LVRS"
- Procedure: "median sternotomy"
- Procedure: "bullectomy"
- Procedure: "lobectomy"
- Condition: "bronchiectasis"
- Qualifier: "Clinically significant"
- Procedure: "surgery"
- Condition: "Pulmonary nodule"
- Condition: "respiratory infections"
- Multiplier: "recurrent"
- Temporal: "History"
- Multiplier: "> 3 in the last year"
- Procedure: "hospitalization"
- Qualifier: "Clinically significant"
- Multiplier: "> 4 Tablespoons per day"
- Observation: "sputum production"
- Condition: "Fever"
- Measurement: "white cell count"
- Value: "elevated"
- Condition: "active infection"
- Mood: "evidence"
- Condition: "Dysrhythmia"
- Condition: "pose a risk"
- Temporal: "during exercise"
- Reference_point: "exercise"
- Temporal: "during training"
- Reference_point: "training"
- Condition: "Congestive heart failure"
- Temporal: "within 6 mo"
- Measurement: "LVEF"
- Value: "< 45%"
- Condition: "Cor Pulmonale"
- Mood: "Evidence"
- Temporal: "history"
- Condition: "Resting bradycardia"
- Value: "< 50 beats/min"
- Condition: "multifocal PVCs"
- Multiplier: "frequent"
- Condition: "complex ventricular arrhythmia"
- Condition: "sustained SVT"
- Condition: "syncope"
- Qualifier: "exercise-related"
- Temporal: "History"
- Condition: "MI"
- Temporal: "within 6 mo"
- Measurement: "LVEF"
- Value: "< 45%"
- Condition: "systemic disease"
- Condition: "neoplasia"
- Qualifier: "expected to compromise survival"
- Temporal: "during 5-yr period"
- Condition: "disease"
- Condition: "condition"
- Qualifier: "interferes with completion of initial or follow-up assessments"
- Observation: "enrolled in another clinical trial"
- Temporal: "currently"
- Observation: "unable to complete"
- Qualifier: "3 minutes of unloaded peddling on cycle ergometer"
- Condition: "Alpha-1-Antitrypsin Deficiency"